Clinical trial exclusion criterion:
Immunosuppressive therapy before operation

Annotated entities:
- Procedure: "Immunosuppressive therapy"
- Temporal: "before operation"
- Procedure: "operation"
- Reference_point: "operation"